¿Cómo se denomina el mecanismo por el cuál la célula microbiana introduce nutrientes, empleando proteínas transportadoras, sin aporte de energía?:
1. Difusión pasiva.
2. Transporte activo.
3. Transferencia simple.
4. Difusión facilitada.

Respuesta correcta: 4. Difusión facilitada.